一般外科的何主任最近進行某項肝癌患者的基因研究，為了要蒐集健康人之對照組，特邀請未來兩個月到一般外科學習的住院醫師及實習醫師自願參與這項研究提供 10 c.c.之血液檢體。在研究倫理的觀點上，下列何項是這種納入受試者的方式最大的爭議？
A. 試驗主持人對受試者參與臨床試驗之意願可能有不當影響
B. 試驗主持人未考慮醫師乃是特殊族群而影響研究效度
C. 試驗主持人難以客觀地解讀研究發現的意義
D. 試驗主持人忽略對受試者耗用的時間給予應有的補償

正確答案：A. 試驗主持人對受試者參與臨床試驗之意願可能有不當影響